preterm delivery (<37 weeks of gestation)

The above is a clinical trial exclusion criterion. Annotated with entity spans:
[Condition: preterm delivery] ([Value: <37 weeks] of [Measurement: gestation])